Usted como enfermera trabaja para un hospital que pertenece a una red mayor de centros sanitarios. Dentro de su centro de trabajo, los ordenadores están interconectados para poder ver en todo momento la información que sea precisa para el adecuado cuidado de sus pacientes. Sin embargo, también están conectados a ordenadores de los otros centros sanitarios que conforman la red. Este tipo de red extendida que le permite visualizar datos que han sido insertados en ordenadores alejados físicamente, pero con los que su ordenador conforma una red, dan lugar a un tipo de red denominada:
1. LAN.
2. WAN.
3. Periférico.
4. Software.

Respuesta correcta: 2. WAN.